Previous discontinuation of treatment with deferiprone or deferoxamine due to adverse events;

The above is a clinical trial exclusion criterion. Annotated with entity spans:
Previous [Procedure: discontinuation of treatment] with [Condition: deferiprone] or [Condition: deferoxamine] due to adverse events;